Clinical trial inclusion criterion:
Patients with Fasting Plasma Glucose <15mmol/L(270mg/dL) on screening

Annotated entities:
- Measurement: "Fasting Plasma Glucose"
- Value: "<15mmol/L"
- Value: "270mg/dL"
- Temporal: "on screening"
- Reference_point: "screening"